下列有關脊髓損傷患者自律神經反射異常（autonomic dysreflxia）的敘述，何者最正確？
A. 在剛受傷的前三個月，最容易出現症狀
B. 胸髓損傷患者發生機率最高
C. 發作時頭痛、冒汗、血壓升高
D. 最常見的誘發原因是情緒激動、緊張

正確答案：C. 發作時頭痛、冒汗、血壓升高